Clinical trial inclusion criterion:
HbA1c =6.5%

Entity relations:
- Has_value("HbA1c", "=6.5%")